major anesthetic risk factors or history of previous problem with anesthesia

The above is a clinical trial exclusion criterion. Annotated with entity spans:
[Qualifier: major] [Condition: anesthetic risk factors] or history of [Temporal: previous] [Condition: problem with anesthesia]